La circonia estabilizada con óxido de calcio:
1. Tiene un enorme exceso en población de oxígeno.
2. Tiene un enorme defecto en población de oxígeno.
3. La población de oxígeno es la misma que en la circonia sin óxido de calcio.
4. No existe relación alguna entre la presencia de calcio y la población de oxígeno.

Respuesta correcta: 2. Tiene un enorme defecto en población de oxígeno.